60歲女性患者，主訴左耳耳塞感2個月，說話時左耳有回音。她感覺躺下來時耳塞感會完全消失。詢問病史，患者最近2個月因肺癌在做化療，體重降了5公斤。耳鏡檢查發現她的左側耳膜會隨	呼吸有規律之震動。最有可能的診斷為何？
A. 中耳肌陣攣（middle ear myoclonus）
B. 歐氏管阻塞（blocked eustachian tube）
C. 美尼爾氏症（Ménière's disease）
D. 歐氏管開放症（patulous eustachian tube）

正確答案：D. 歐氏管開放症（patulous eustachian tube）